10 歲男孩呈現水腦及頻尿等尿崩現象，核磁共振造影顯示腦內鞍凹有一個 3 公分囊狀鈣化性腫瘤，則下列那一項診斷最適當？
A. 顱咽管瘤（craniopharyngioma）
B. 鈣化性腦下垂體瘤（calcified pituitary adenoma）
C. 室管膜瘤（ependymoma）
D. 寡樹突細胞瘤（oligodendroglioma）

正確答案：A. 顱咽管瘤（craniopharyngioma）